En la formación de la piel intervienen:
1. Solo el ectodermo.
2. El ectodermo, mesodermo y células de la cresta neural.
3. El ectodermo y mesodermo.
4. El ectodermo y células de la cresta neural.
5. Solo el mesodermo.

Respuesta correcta: 2. El ectodermo, mesodermo y células de la cresta neural.